Clinical trial exclusion criterion:
Patients are advised not to participate in the gentamicin arm if

Annotated entities:
- Non-representable: "Patients are advised not to participate in the gentamicin arm if"